有一染色體為 47, XY, +21 之 18 歲矮壯青年由母親陪同來門診，此青年希望結婚生小孩，下列何種情況是較符合醫療知識及倫理之建議？
A. 基於優生保健不應結婚生小孩
B. 可以結婚生小孩
C. 可以結婚但是可能不會生小孩
D. 無法行房無法生小孩

正確答案：C. 可以結婚但是可能不會生小孩